李先生因為解黑便三天，且清晨開始有吐血的情形而被送至急診處。需要及早照會外科手術治療的適應症，下列何者錯誤？
A. 胃鏡檢查結果為改良強生分類第五型（modified Johnson classification V）胃潰瘍
B. 年齡大於六十歲
C. 十二指腸潰瘍直徑大於二公分
D. 潰瘍底部有可見血管

正確答案：A. 胃鏡檢查結果為改良強生分類第五型（modified Johnson classification V）胃潰瘍